有關中間絲（intermediate filament）的敘述下列何者正確？
A. 直徑約 5nm
B. 由微絲（microfilament）聚集形成
C. 由微管蛋白（tubulin）組成
D. 是構成細胞骨架（cytoskeleton）的主要成分

正確答案：D. 是構成細胞骨架（cytoskeleton）的主要成分